Clinical trial exclusion criterion:
Acute heart failure or acute exacerbation of chronic heart failure within the past 2 weeks.

Annotated entities:
- Condition: "Acute heart failure"
- Condition: "exacerbation"
- Qualifier: "acute"
- Condition: "chronic heart failure"
- Temporal: "within the past 2 weeks"